¿Cuál de las siguientes secuencias se añade durante la maduración o procesamiento del RNA de trasferencia eucariota?:
1. Sitio de splicing 5’ del intrón.
2. Secuencia CCA de carga del aminoácido.
3. Anticodón.
4. Sitio de splicing 3’ del intrón.
5. Secuencia líder del extremo 5’.

Respuesta correcta: 2. Secuencia CCA de carga del aminoácido.